Paciente de 52 años de edad que refiere disnea de medianos esfuerzos desde hace 6 meses. No ha presentado angina ni síncopes. La exploración física y las pruebas diagnósticas demuestran la existencia de un gradiente transvalvular aórtico medio de 55 mmHg y un área calculada de 0,7 cm2. Fracción de eyección del 65%. El tratamiento que debe indicarse a este paciente es:
1. Diuréticos y controles más frecuentes por un especialista.
2. En caso de aumentar la disnea de esfuerzo, debe practicarse una dilatación percutánea de la válvula aórtica con catéter de balón.
3. Sustitución de la válvula aórtica por una prótesis / bioprótesis.
4. Sustitución de la válvula aórtica por un homoinjerto.
5. Implante de una válvula percutánea.

Respuesta correcta: 3. Sustitución de la válvula aórtica por una prótesis / bioprótesis.